Clinical trial inclusion criterion:
type 2 diabetes mellitus

Annotated entities:
- Condition: "type 2 diabetes mellitus"